Clinical trial exclusion criterion:
Self reported renal disease (severe impaired renal function)

Entity relations:
- Has_qualifier("renal disease", "Self reported")
- Has_qualifier("impaired renal function", "severe")
- Subsumes("renal disease", "impaired renal function")